Clinical trial inclusion criterion:
Female at birth and identifies as female gender

Annotated entities:
- Person: "Female"
- Temporal: "at birth"
- Reference_point: "birth"
- Person: "gender"
- Value: "female"